Which genes are associated with Epidermolysis Bullosa Simplex?

In one family studied, inheritance of EBS is linked to the gene encoding keratin 14